Previous atrial ablation.

The above is a clinical trial exclusion criterion. Annotated with entity spans:
Previous [Procedure: atrial ablation].